Clinical trial exclusion criterion:
Focal seizures with preserved level of consciousness

Entity relations:
- AND("Focal seizures", "preserved level of consciousness")